凱格爾運動（Kegel exercises）最主要的目的是：
A. 加強生產後腹部肌肉的力量
B. 增強膀胱及近端尿道的肌肉力量
C. 預防生產後骨盆肌肉的神經受傷
D. 降低老化產生之肌肉萎縮現象

正確答案：B. 增強膀胱及近端尿道的肌肉力量